Clinical trial inclusion criterion:
History of snake bite with features of local envenomation with/without systemic features

Entity relations:
- Has_mood("local envenomation", "features of")
- AND("local envenomation", "systemic features")
- AND("snake bite", "local envenomation")